Clinical trial inclusion criteria:
Healthy, term, breastfeeding infants who will be predominately breastfed for at least 6-months. This will be determined by answering yes/no to question 'do you intend to breastfeed until your infant is at least 6 months of age.'

Annotated entities:
- Condition: "Healthy"
- Condition: "term"
- Observation: "breastfeeding"
- Person: "infants"
- Observation: "predominately breastfed"
- Multiplier: "for at least 6-months"
- Non-representable: "This will be determined by answering yes/no to question 'do you intend to breastfeed until your infant is at least 6 months of age.'"